Clinical trial exclusion criterion:
Liver disease (known history of hepatitis B or C, cirrhosis, nonalcoholic steatohepatitis, history of alcoholism, ALT/AST greater than 3 times upper limit of normal in the past 3 months)

Annotated entities:
- Condition: "Liver disease"
- Temporal: "history"
- Condition: "hepatitis B"
- Condition: "hepatitis C"
- Condition: "cirrhosis"
- Condition: "nonalcoholic steatohepatitis"
- Temporal: "history"
- Condition: "alcoholism"
- Measurement: "ALT/AST"
- Value: "greater than 3 times upper limit of normal"
- Temporal: "in the past 3 months"